Clinical trial inclusion criterion:
9. >18 years of age.

Entity relations:
- Has_value("age", ">18 years")